A positive pre-study Hepatitis B surface antigen or positive Hepatitis C antibody result within 3 months of screening

The above is a clinical trial exclusion criterion. Annotated with entity spans:
A [Value: positive] [Temporal: pre-study] [Measurement: Hepatitis B surface antigen] or [Value: positive] [Measurement: Hepatitis C antibody] result [Temporal: within 3 months of screening]